Indique en qué situación la carboxihemoglobina se encuentra elevada:
1. Envenenamiento por nitratos.
2. Anemia falciforme.
3. Exposición a monóxido de carbono.
4. Toxicidad por sulfamidas.

Respuesta correcta: 3. Exposición a monóxido de carbono.